Planned pleurodesis

The above is a clinical trial exclusion criterion. Annotated with entity spans:
[Non-query-able: Planned pleurodesis]